Diagnosis of other active, ongoing skin diseases or skin infections that may interfere with examination of psoriasis lesions

The above is a clinical trial exclusion criterion. Annotated with entity spans:
Diagnosis of other [Qualifier: active], [Temporal: ongoing] [Condition: skin diseases] or [Condition: skin infections] that may [Non-representable: interfere with examination of psoriasis lesions]